Clinical trial exclusion criterion:
Age < 20 or > 35 years.

Annotated entities:
- Person: "Age"
- Value: "< 20 or > 35 years"